Clinical trial exclusion criterion:
History of chronic alcohol consumption and/or drug abuse.

Entity relations:
- Has_temporal("chronic alcohol consumption", "History")
- OR("chronic alcohol consumption", "drug abuse")